En la cadena respiratoria:
1. Las proteínas ferrosulfuradas contienen grupos hemo.
2. Los grupos hemo están en carotenoides.
3. Los citocromos contienen grupos de hierro y azufre.
4. Las ubiquinonas transportan protones y electrones.
5. Todos los transportadores transportan dos electrones.

Respuesta correcta: 4. Las ubiquinonas transportan protones y electrones.